一位48歲男性，身高170公分，體重85公斤，空腹血糖136 mg/dl。想減重以維持健康，但對運動沒有興趣。你建議他將每日熱量攝取減少500大卡。如果其它條件不變，持續這種飲食控制，六週後約可減重幾公斤？
A. 1公斤
B. 3公斤
C. 4.5公斤
D. 6公斤

正確答案：B. 3公斤